Patients in whom a LEN-DEX-based treatment regimen is indicated

The above is a clinical trial inclusion criterion. Annotated with entity spans:
Patients in whom a [Qualifier: LEN-DEX-based] [Procedure: treatment regimen] [Mood: is indicated]